Clinical trial inclusion criterion:
Healthy

Annotated entities:
- Condition: "Healthy"